Clinical trial inclusion criterion:
Patients with non-cystic fibrosis bronchiectasis diagnosed by high-resolution CT;

Annotated entities:
- Condition: "non-cystic fibrosis bronchiectasis"
- Procedure: "high-resolution CT"